Clinical trial inclusion criteria:
Primary kidney transplant recipients, adults

Annotated entities:
- Procedure: "kidney transplant"
- Qualifier: "Primary"
- Person: "adults"